Clinical trial exclusion criterion:
Has a history of (non-infectious) pneumonitis that required steroids or current pneumonitis

Annotated entities:
- Drug: "steroids"
- Drug: "pneumonitis"
- Temporal: "current"
- Temporal: "history"
- Condition: "non-infectious) pneumonitis"